Patients with chronic immunosuppression (such as HIV/AIDS).

The above is a clinical trial exclusion criterion. Annotated with entity spans:
Patients with [Qualifier: chronic] [Condition: immunosuppression] (such as [Condition: HIV/AIDS]).